A prescription of a NOAC within 90 days prior to hospitalization or outpatient clinic visit for VTE.

The above is a clinical trial exclusion criterion. Annotated with entity spans:
A prescription of a [Drug: NOAC] [Temporal: within 90 days prior to hospitalization or outpatient clinic visit for VTE].